50 歲男性，過去有高血壓及十二指腸潰瘍病史，上個月曾經因為左側輸尿管結石去過急診，最近常感到倦怠、四肢肌肉無力，則下列何種檢查，較無診斷價值？
A. 血鈣濃度
B. 血中鹼性磷酸酶（alkaline phosphatase）濃度
C. 血中副甲狀腺素（iPTH）濃度
D. 血中三酸甘油脂（triglyceride）濃度

正確答案：D. 血中三酸甘油脂（triglyceride）濃度